Hombre de 75 años que refiere disminución de agudeza visual central en su ojo derecho de dos semanas de evolución. En el examen de fondo de ojo    se   aprecian     drusas    blandas    y desprendimiento seroso a nivel de la mácula. ¿Qué tratamiento es actualmente el más indicado para esta enfermedad?
1. Fotocoagulación focal con láser.
2. Terapia fotodinámica.
3. Inyecciones    intravítreas   de      fármacos antiangiogénicos.
4. Vitrectomía posterior.
5. Observación.

Respuesta correcta: 3. Inyecciones    intravítreas   de      fármacos antiangiogénicos.